Clinical trial inclusion criterion:
3. Histologically confirmed squamous cell bronchogenic carcinoma. Patients whose tumors contain mixed non-small cell histologies are eligible, as long as squamous carcinoma is the predominant histology. Mixed tumors with small cell anaplastic elements are not eligible. Cytologic specimens obtained by brushings, washings, or needle aspiration of the defined lesion are acceptable.

Entity relations:
- Has_value("Histologically", "confirmed")
- AND("squamous cell bronchogenic carcinoma", "Histologically")
- Has_qualifier("squamous carcinoma", "predominant histology")
- AND("mixed non-small cell histologies", "squamous carcinoma")
- Has_qualifier("Mixed tumors", "small cell anaplastic elements")
- multi("small cell anaplastic elements", "small cell anaplastic elements")
- Has_negation("small cell anaplastic elements", "not")